Clinical trial exclusion criteria:
Pregnancy
Hemodynamic instability
Body mass index greater than 40 kg / m2
Use of intravenous amiodarone or lidocaine in the last 24 hours
Acute coronary syndrome
Presence of tachycardia with irregular or supraventricular RR
Contraindications to study drugs

Annotated entities:
- Condition: "Pregnancy"
- Condition: "Hemodynamic instability"
- Measurement: "Body mass index"
- Value: "greater than 40 kg / m2"
- Qualifier: "intravenous"
- Drug: "amiodarone"
- Drug: "lidocaine"
- Temporal: "in the last 24 hours"
- Condition: "Acute coronary syndrome"
- Condition: "tachycardia"
- Condition: "irregular RR"
- Condition: "supraventricular RR"
- Condition: "Contraindications"
- Drug: "study drugs"